The use of magnesium in any dose that is prescribed for the purpose of HA prevention or treatment must be stable for at least 4 weeks. The incidental use of magnesium in multi-vitamins, laxatives, etc. is permissible but must be documented.

The above is a clinical trial exclusion criterion. Annotated with entity spans:
[Non-representable: The use of magnesium in any dose that is prescribed for the purpose of HA prevention or treatment must be stable for at least 4 weeks. The incidental use of magnesium in multi-vitamins, laxatives, etc. is permissible but must be documented.]